Clinical trial exclusion criterion:
Individuals will be excluded from enrollment if, at the time of enrollment, their M. tuberculosis isolate is already known to be resistant to any of the study drugs.

Annotated entities:
- Condition: "M. tuberculosis isolate"
- Qualifier: "resistant to any of the study drugs"
- Drug: "study drugs"